List characteristics of Developmental and Epileptic Encephalopathies (DEEs).

Developmental epileptic encephalopathies (DEEs) are genetically heterogeneous severe childhood-onset epilepsies with developmental delay or cognitive deficits.